¿Cuál de las siguientes moléculas presenta el momento dipolar más alto?:
1. HCI.
2. NH3.
3. HF.
4. CO2.
5. Trans-CHCI=CHCI.

Respuesta correcta: 3. HF.